El grafito es un conductor debido a que:
1. La banda de valencia posee vacantes electrónicas.
2. La banda de conducción posee vacantes electrónicas.
3. Ambas bandas poseen vacantes electrónicas.
4. La banda prohibida es muy grande.
5. La banda prohibida es cero.

Respuesta correcta: 5. La banda prohibida es cero.